Clinical trial exclusion criterion:
Subject has sustained pathologic fractures of the vertebra or multiple fractures of the vertebra or hip.

Entity relations:
- Has_multiplier("fractures of the vertebra", "multiple")
- Has_qualifier("fractures of the vertebra", "pathologic")
- OR("fractures of the vertebra", "fractures of the hip")
- OR("fractures of the vertebra", "fractures of the vertebra")